¿Qué tipo de intervención de prevención primaria está indicada durante el periodo pre patogénico de enfermedades cardiovasculares?:
1. Realizar la valoración del riesgo cardiovascular utilizando la escala SCORE desde la adolescencia.
2. Control de los niveles de colesterol total periódicamente en función de la edad.
3. Control de tensión arterial periódicamente en función de la edad.
4. Promoción de estilos de vida saludables: consumo de tabaco, dieta y ejercicio principalmente.
5. Todas las medidas están indicadas.

Respuesta correcta: 4. Promoción de estilos de vida saludables: consumo de tabaco, dieta y ejercicio principalmente.